Clinical trial inclusion criterion:
Visual impairment predominantly due to abnormal new vessel ingrowth and/or macular edema. The presence of fluid (intraretinal, subretinal or sub-RPE) detected clinically or on the ocular coherence tomography.

Entity relations:
- Subsumes("fluid", "intraretinal")
- AND("ocular coherence tomography", "fluid")
- AND("Visual impairment", "abnormal new vessel ingrowth")
- OR("abnormal new vessel ingrowth", "macular edema")
- OR("intraretinal", "subretinal", "sub-RPE")